下列關於hepatocellular adenoma的敘述何者錯誤？
A. 為良性肝細胞的增生
B. 與maturity onset diabetes of the young type 3（MODY-3）有關的是HNF1-alpha inactivated hepatocellular adenoma
C. beta-catenin activated adenoma在所有hepatocellular adenoma型別中，惡性化風險（risk for malignant transformation）最低
D. gp130的突變出現在inflammatory type adenoma

正確答案：C. beta-catenin activated adenoma在所有hepatocellular adenoma型別中，惡性化風險（risk for malignant transformation）最低